下列有關生物毒性之敘述，何者錯誤？
A. 被蜜蜂螫傷，在數分鐘內死亡的主要原因為過敏性休克
B. 被水母螫傷，在數分鐘內死亡的主要原因為過敏性休克
C. 被海膽刺傷，建議傷口用冷敷，以減輕其毒性
D. 吃有執照廚師烹調的河豚，也可能致命

正確答案：C. 被海膽刺傷，建議傷口用冷敷，以減輕其毒性